一位 30 歲之抽菸男性患者，常因感冒引發呼吸困難、咳嗽及喘鳴聲，且常有凌晨發作之情形，下列診斷何者可能性最高？
A. 慢性阻塞性肺病
B. 氣喘症
C. 心臟衰竭
D. 肺栓塞症

正確答案：B. 氣喘症